下列有關光波物理性質的敘述，何者錯誤？
A. 各種顏色不同波長之光波在真空中的速度是一樣的
B. 不同波長之色光在一般介質的速度是不一樣的
C. 光線在一般介質的相對折射係數（refractive index）均大於 1
D. +1D（屈光度，diopter）透鏡的焦距（focal length）訂為一公尺，則+2D 鏡片的焦距為兩公尺

正確答案：D. +1D（屈光度，diopter）透鏡的焦距（focal length）訂為一公尺，則+2D 鏡片的焦距為兩公尺